先天性甲狀腺低能症（congenital hypothyroidism）的新生兒，最常見下列何項症狀？
A. 出生時身高體重明顯過小
B. 出生時頭圍較小
C. 睡眠不好常會哭鬧
D. 新生兒黃疸持續時間較長

正確答案：D. 新生兒黃疸持續時間較長